HIV-positive subjects on combination antiretroviral therapy are ineligible because of the potential for pharmacokinetic interactions with Venetoclax. In addition, these subjects are at increased risk of lethal infections when treated with marrow suppressive therapy. Appropriate studies will be undertaken in subjects receiving combination antiretroviral therapy when indicated. HIV testing prior to enrollment is not required for screening but strongly encouraged for patients with no documented prior HIV assessment.

The above is a clinical trial exclusion criterion. Annotated with entity spans:
[Condition: HIV-positive] subjects on [Procedure: combination antiretroviral therapy] are ineligible because of the potential for pharmacokinetic interactions with Venetoclax. [Non-representable: In addition, these subjects are at increased risk of lethal infections when treated with marrow suppressive therapy.] [Parsing_Error: Appropriate studies will be undertaken in subjects receiving combination antiretroviral therapy when indicated.] [Not_a_criteria: HIV testing prior to enrollment is not required for screening but strongly encouraged for patients with no documented prior HIV assessment.]